Clinical trial inclusion criterion:
Age range: 14 to 65 years-old;

Entity relations:
- Has_value("Age", "14 to 65 years-old")